History of: craniotomy, cerebral metastases, cerebrovascular accident; current diagnosis of seizure disorder, schizophrenia, schizo-affective disorder, dementia, mental retardation, or major depression with psychotic features; or use of depot neuroleptics in last 12 months.

The above is a clinical trial exclusion criterion. Annotated with entity spans:
[Temporal: History] of: [Procedure: craniotomy], [Condition: cerebral metastases], [Condition: cerebrovascular accident]; current diagnosis of [Condition: seizure disorder], [Condition: schizophrenia], [Condition: schizo-affective disorder], [Condition: dementia], [Condition: mental retardation], or [Condition: major depression] with [Condition: psychotic features]; or use of [Drug: depot neuroleptics] [Temporal: in last 12 months].